What causes the "worst headache" of a patient's life?

Aneurysmal subarachnoid hemorrhage (SAH) is associated with a mortality of more than 30%. Acute, severe headache, typically described as the worst headache of the patient's life, and meningismus are the characteristic manifestations of SAH.